Clinical trial inclusion criterion:
ASA I-III patients scheduled for elective one or two level minimally invasive lumbar fusions

Entity relations:
- Has_value("ASA", "I-III")
- Has_qualifier("minimally invasive lumbar fusions", "one level")
- Has_qualifier("minimally invasive lumbar fusions", "elective")
- Has_mood("minimally invasive lumbar fusions", "scheduled")
- OR("one level", "two level")